Clinical trial exclusion criterion:
Significant valvular heart disease, congenital heart disease, pulmonary heart disease or perinatal heart disease.

Annotated entities:
- Condition: "valvular heart disease"
- Qualifier: "Significant"
- Condition: "congenital heart disease"
- Condition: "pulmonary heart disease"
- Condition: "perinatal heart disease"